El indinavir es un inhibidor selectivo de la proteasa del VIH porque:
1. Por hidrólisis genera el fármaco activo.
2. Alquila de forma irreversible el centro activo de la enzima.
3. Su estructura imita el estado de transición de la reacción catalizada por la enzima.
4. Es un inhibidor suicida.
5. Su estructura simétrica interacciona eficazmente con el centro activo de la enzima.

Respuesta correcta: 3. Su estructura imita el estado de transición de la reacción catalizada por la enzima.